Clinical trial inclusion criteria:
Meets Diagnostic and Statistical Manual of Mental Disorders (Versions 4 and 5) criteria for and Major Depressive Disorder.
Hamilton Depression Rating Scale-17 score greater than 18.
Men and women between ages >=18 and 65.

Annotated entities:
- Measurement: "Diagnostic and Statistical Manual of Mental Disorders criteria"
- Qualifier: "Versions 4"
- Qualifier: "Versions 5"
- Parsing_Error: "and"
- Condition: "Major Depressive Disorder"
- Parsing_Error: "and"
- Measurement: "Hamilton Depression Rating Scale"
- Value: "greater than 18"
- Person: "Men"
- Person: "women"
- Parsing_Error: "and"
- Person: "ages"
- Value: "between 18 and 65"
- Parsing_Error: ">="